Clinical trial exclusion criterion:
Pregnant woman or lactating woman.

Annotated entities:
- Condition: "Pregnant"
- Person: "woman"
- Condition: "lactating"
- Person: "woman"